Short bowel syndrome that can cause inflammatory bowel disease (ulcerative colitis, Crohn's disease) and drug absorption disorder.

The above is a clinical trial exclusion criterion. Annotated with entity spans:
[Condition: Short bowel syndrome] [Qualifier: that can cause inflammatory bowel disease] ([Condition: ulcerative colitis], [Condition: Crohn's disease]) and [Condition: drug absorption disorder].